Clinical trial inclusion criterion:
planned elective cholecystectomy

Annotated entities:
- Mood: "planned"
- Qualifier: "elective"
- Condition: "cholecystectomy"